Life expectancy 6 weeks or greater

The above is a clinical trial inclusion criterion. Annotated with entity spans:
[Observation: Life expectancy] [Value: 6 weeks or greater]